Severe bradycardia or greater than 1st degree heart block

The above is a clinical trial exclusion criterion. Annotated with entity spans:
[Qualifier: Severe] [Condition: bradycardia] or [Qualifier: greater than 1st degree] [Condition: heart block]